Paciente de 34 años que jugando a tenis recibe el impacto de la bola a nivel de la órbita izquierda. A la exploración presenta importante hematoma palpebral, hiposfagma, diplopia a la visión superior con limitación de la versión superior del globo ocular. ¿Qué sospecharía?
1. Fractura de la pared inferior del suelo de la órbita con atrapamiento del músculo recto inferior.
2. Fractura del arco cigomático.
3. Fractura de la pared superior de la órbita con atrapamiento del músculo recto superior.
4. Fractura dentoalveolar.

Respuesta correcta: 1. Fractura de la pared inferior del suelo de la órbita con atrapamiento del músculo recto inferior.